Clinical trial inclusion criterion:
8. Subject and the treating physician agree that the subject will comply with all follow-up evaluations.

Annotated entities:
- Post-eligibility: "Subject and the treating physician agree that the subject will comply with all follow-up evaluations."